Has a transplanted organ (with the exception of a corneal transplant performed >= 3 months prior to baseline)

The above is a clinical trial exclusion criterion. Annotated with entity spans:
Has a [Procedure: transplanted organ] (with the [Negation: exception of] a [Procedure: corneal transplant] performed [Temporal: >= 3 months prior to baseline])